Clinical trial exclusion criterion:
History of prior stroke

Entity relations:
- Has_temporal("stroke", "prior")